體液滲透壓增加時，較易促進下列何者的分泌？
A. 黃體素（progesterone）
B. 醛固酮（aldosterone）
C. 皮質素（cortisol）
D. 升壓素（vasopressin）

正確答案：D. 升壓素（vasopressin）